Clinical trial inclusion criterion:
Age older than 30 years

Annotated entities:
- Person: "Age"
- Value: "older than 30 years"